Clinical trial exclusion criterion:
Severe distal arteriopathie > stage II of Leriche and Fontaine

Entity relations:
- Has_value("stage of Leriche and Fontaine", "> II")
- Has_qualifier("distal arteriopathie", "Severe")
- AND("distal arteriopathie", "stage of Leriche and Fontaine")